Clinical trial inclusion criterion:
Willing and able to participate in the study, including willing to go to the study pharmacy to obtain mifepristone

Entity relations:
- AND("willing to go to the study pharmacy", "mifepristone")
- Has_mood("mifepristone", "to obtain")